Clinical trial exclusion criterion:
Patient refusal

Annotated entities:
- Post-eligibility: "Patient refusal"